破骨細胞（osteoclast）較常出現的區域是：
A. 骺板細胞增殖區（zone of cell proliferation）
B. 骺板細胞肥大和軟骨鈣化區（zone of hypertrophy and calcification）
C. 骺板軟骨儲備區（zone of reserve cartilage）
D. 骺板骨化區（osteogenic zone）

正確答案：D. 骺板骨化區（osteogenic zone）